Clinical trial exclusion criterion:
Presence of vomiting

Annotated entities:
- Condition: "vomiting"